Ankle-brachial pressure index above 0.7.

The above is a clinical trial inclusion criterion. Annotated with entity spans:
[Measurement: Ankle-brachial pressure index] [Value: above 0.7].